Clinical trial exclusion criterion:
Use of blood products within 12 months before the vaccination;

Entity relations:
- Has_index("within 12 months before the vaccination", "the vaccination")
- Has_temporal("blood products", "within 12 months before the vaccination")